下列何種藥物是acetaminophen中毒時的最佳解毒劑？
A. Atropine
B. Acetylcysteine
C. Physostigmine
D. Pralidoxime

正確答案：B. Acetylcysteine